Las curvas de calibrado utilizadas en análisis químico:
1. Representan la respuesta de un método analítico a concentraciones desconocidas de analito.
2. Utilizan muestras patrón que contienen el disolvente utilizado en el método analítico, pero sin analito.
3. Utilizan una disolución patrón que permite conocer la respuesta del método analítico a las especies interferentes que existan en los reactivos.
4. Se construyen preparando muestras de concentración conocida de analito (patrones) y determinando la respuesta del procedimiento analítico a estos patrones.
5. Se construyen utilizando muestras de concentración desconocida de analito y midiendo la respuesta del procedimiento analítico a las mismas.

Respuesta correcta: 4. Se construyen preparando muestras de concentración conocida de analito (patrones) y determinando la respuesta del procedimiento analítico a estos patrones.